En la adolescencia es frecuente pensar que los demás están extremadamente interesados en uno mismo ¿Cómo se denomina este sesgo egocéntrico?:
1. Propiocentrismo.
2. Fábula personal.
3. Fábula de invencibilidad.
4. Audiencia imaginaria.
5. Pseudoparanoia.

Respuesta correcta: 4. Audiencia imaginaria.